一病人作口服葡萄糖耐性試驗（oral glucose tolerance test）的結果如下：時間（分） 	0＇ 	30＇ 	60＇ 	90＇ 	120＇ 	  	血糖（mg%） 110 	220 	190 	178 	155 
 則其診斷為：
A. 正常
B. 糖尿病
C. 葡萄糖耐受性異常（impaired glucose tolerance）
D. 只作一次無法診斷

正確答案：C. 葡萄糖耐受性異常（impaired glucose tolerance）